Resident in Scotland with a Community Health Index (CHI) number

The above is a clinical trial inclusion criterion. Annotated with entity spans:
[Person: Resident] in [Visit: Scotland] with a [Non-representable: Community Health Index (CHI) number]